Significant renal disease manifested by creatinine clearance of < 30 ml/min)

The above is a clinical trial exclusion criterion. Annotated with entity spans:
[Qualifier: Significant] [Condition: renal disease] manifested by [Measurement: creatinine clearance] of [Value: < 30 ml/min])